History of stroke within 3 months;

The above is a clinical trial exclusion criterion. Annotated with entity spans:
History of [Condition: stroke] [Value: within 3 months];